下列何種情形不符合立即通報兒少保護小組之條件？
A. 有超過3次以上急診外傷就醫紀錄且檢查結果與受傷機制不符
B. 病史前後不一致且延遲就醫
C. 低處（小於150公分）跌落以致骨折
D. 2歲以上兒童之單一手部骨折

正確答案：D. 2歲以上兒童之單一手部骨折